Describe a cytokine release syndrome.

Cytokine release syndrome is defined by the release of cytokines from sarcoplasmic reticulum (SR) and is associated with retinal vein occlusions, fatigue and dyspnea.